Patients with leg injury involving nerve damage

The above is a clinical trial exclusion criterion. Annotated with entity spans:
Patients with [Condition: leg injury] involving [Condition: nerve damage]